Clinical trial inclusion criterion:
Female

Annotated entities:
- Person: "Female"